Clinical trial exclusion criterion:
Known heart failure

Annotated entities:
- Condition: "heart failure"